Which is the main abnormality that arises with Sox9 locus duplication?

Autosomal XX sex reversal caused by duplication of SOX9